Clinical trial exclusion criterion:
Uncontrolled hypertension

Entity relations:
- Has_qualifier("hypertension", "Uncontrolled")